Clinical trial exclusion criterion:
serious concomitant illness and malignant tumor of any kind

Entity relations:
- Has_qualifier("illness", "serious")
- Has_temporal("illness", "concomitant")
- Has_qualifier("malignant tumor", "any kind")